Clinical trial inclusion criterion:
Hyperthermic intraperitoneal chemotherapy (HIPEC)

Annotated entities:
- Procedure: "Hyperthermic intraperitoneal chemotherapy"
- Procedure: "HIPEC"